Need for long-term treatment with a low molecular weight heparin, vitamin K antagonists or NOAC, for an indication other than the index PE episode, or for antiplatelet agents except acetylsalicylic acid at a dosage =100 mg/day;

The above is a clinical trial exclusion criterion. Annotated with entity spans:
Need for [Qualifier: long-term] treatment with a [Drug: low molecular weight heparin], [Drug: vitamin K antagonists] or [Drug: NOAC], for an indication [Negation: other] than the [Qualifier: index] [Condition: PE episode], or for [Drug: antiplatelet agents] [Negation: except] [Drug: acetylsalicylic acid] at a dosage [Multiplier: =100 mg/day;]